Clinical trial exclusion criterion:
Patients attending for a therapeutic endoscopic procedure e.g. variceal banding, stent insertion, balloon dilatation.

Entity relations:
- Subsumes("therapeutic endoscopic procedure", "variceal banding")
- OR("variceal banding", "stent insertion", "balloon dilatation")